Clinical trial exclusion criterion:
Use of anti-dementia medications (Aricept, Exelon, Razadyne) and memantine (Namenda)) or anti-Parkinsonian medications (Sinemet, amantadine, bromocriptine, pergolide, selegeline).

Entity relations:
- Subsumes("anti-dementia medications", "Aricept")
- Subsumes("memantine", "Namenda")
- Subsumes("anti-Parkinsonian medications", "Sinemet")
- OR("Aricept", "Exelon", "Razadyne")
- OR("anti-dementia medications", "memantine", "anti-Parkinsonian medications")
- OR("Sinemet", "pergolide", "bromocriptine", "amantadine", "selegeline")